Clinical trial exclusion criterion:
Contraindication to spinal anaesthesia

Annotated entities:
- Condition: "Contraindication"
- Procedure: "spinal anaesthesia"